¿Qué se denomina “línea base” en los diseños de investigación de caso único o diseños N=1?:
1. La diferencia existente entre las medidas pretest y postest del participante.
2. La referencia normativa de la población con la que comparar los resultados de la intervención.
3. Los cambios detectados en la variable dependiente como consecuencia de la aplicación del tratamiento.
4. La serie de observaciones de la variable dependiente realizadas antes de aplicar el tratamiento.
5. La ausencia de variabilidad en las observaciones de la variable dependiente.

Respuesta correcta: 4. La serie de observaciones de la variable dependiente realizadas antes de aplicar el tratamiento.